Clinical trial inclusion criterion:
Subject has structural normal heart with an LVEF = 50%, thickness of the inter-ventricular septum =12 mm and left atrium diameters (short axis) < 46 mm obtained by transthoracic echocardiography.

Annotated entities:
- Condition: "heart"
- Qualifier: "normal"
- Qualifier: "structural"
- Measurement: "LVEF"
- Value: "= 50%,"
- Measurement: "thickness of the inter-ventricular septum"
- Value: "=12 mm"
- Measurement: "left atrium diameters"
- Value: "< 46 mm"
- Measurement: "short axis"
- Procedure: "transthoracic echocardiography"